Clinical trial exclusion criterion:
1. Antibiotics: clarithromycin, erythromycin, telithromycin, nafcillin, rifampin

Entity relations:
- OR("clarithromycin", "erythromycin", "telithromycin", "nafcillin", "rifampin")